一位 20 歲原本健康的男性，被朋友發現意識不清，送急診室時血壓 90/40 mmHg，兩眼瞳孔直徑 1 mm 等大，昏迷指數（Glasgow Coma Scale, GCS）為 E1V1M4，若要做診斷性治療時，下列何者最不適當？
A. Atropine
B. Naloxone
C. Flumazenil
D. Physostigmine

正確答案：D. Physostigmine